Male subjects (whether surgically sterilized or not) with female partners of child-bearing potential must use two forms of contraception, one of which must be a barrier method, for the duration of the study and for 77 days after the last dose

The above is a clinical trial inclusion criterion. Annotated with entity spans:
[Person: Male] subjects (whether [Condition: surgically sterilized] or [Negation: not]) with [Person: female] partners of [Condition: child-bearing potential] must use [Multiplier: two] [Device: forms of contraception], one of which must be a [Device: barrier method], [Temporal: for the duration of the study] and [Temporal: for 77 days after the last dose]